History of malignancy, except basal skin cell carcinoma

The above is a clinical trial exclusion criterion. Annotated with entity spans:
History of [Condition: malignancy], [Negation: except] [Condition: basal skin cell carcinoma]